Presence of major contraindications to magnetic resonance imaging (cardiac pacemakers, claustrophobia, foreign bodies and implanted medical devices with ferromagnetic properties).

The above is a clinical trial exclusion criterion. Annotated with entity spans:
Presence of [Observation: major contraindications] to [Procedure: magnetic resonance imaging] ([Device: cardiac pacemakers], [Condition: claustrophobia], [Observation: foreign bodies] and [Device: implanted medical devices] with [Qualifier: ferromagnetic properties]).